neurofibromatosis

The above is a clinical trial exclusion criterion. Annotated with entity spans:
[Condition: neurofibromatosis]